Clinical trial inclusion criterion:
Undergoing elective primary, revision, or second stage re-implantation total or uni compartmental knee replacement;

Annotated entities:
- Procedure: "knee replacement"
- Qualifier: "uni compartmental"
- Qualifier: "second stage re-implantation total"
- Qualifier: "revision"
- Qualifier: "primary"
- Qualifier: "elective"